Clinical trial exclusion criterion:
Hematopoietic cell transplantation within 4 weeks of first dose of 852A

Entity relations:
- AND("within 4 weeks of first dose", "852A")
- Has_temporal("Hematopoietic cell transplantation", "within 4 weeks of first dose")